Clinical trial exclusion criterion:
severe valvular or left ventricular outflow obstruction disease needing intervention;

Entity relations:
- Has_qualifier("valvular disease", "severe")
- AND("valvular disease", "intervention")
- OR("valvular disease", "left ventricular outflow obstruction")